有位女士自助旅行回來發生下痢，給與止瀉藥物無法改善症狀，此患者可能因感染革蘭氏陰性桿菌所引起，下列何者為治療此患者之首選藥物？
A. levofloxacin
B. sulfacetamide
C. trimethoprim
D. vancomycin

正確答案：A. levofloxacin